El tumor maligno más frecuente de la glándula submaxilar es:
1. Carcinoma mucoepidermoide.
2. Carcinoma ex-adenoma pleomorfo.
3. Linfoma.
4. Cilindroma o carcinoma adenoide quístico.
5. Cistoadenolinfoma papilomatoso.

Respuesta correcta: 4. Cilindroma o carcinoma adenoide quístico.